一位 80 歲女性因右上腹痛合併發燒，生化檢查顯示：total protein 6.8 g/dL，albumin 3.8 g/dL，ALT  200 U/L，AST 100 U/L，alkaline phosphatase 300 U/L（正常值＜100 U/L），γ-glutamyl transpeptidase  U/L（正常值＜52 U/L），total bilirubin 5 mg/dL，direct bilirubin 3.5 mg/dL。下列何者為最可能的診斷？
A. 酒精性肝病
B. 肝臟囊腫
C. 脂肪肝
D. 總膽管結石

正確答案：D. 總膽管結石